El praziquantel está indicado frente a:
1. Dicrocoelium dendriticum.
2. Plasmodium.
3. Taenia saginata.
4. Toxoplasma gondii.
5. Entamoeba histolytica.

Respuesta correcta: 3. Taenia saginata.